Subjects who are pregnant or nursing.

The above is a clinical trial exclusion criterion. Annotated with entity spans:
Subjects who are [Condition: pregnant] or [Condition: nursing].